Male or female term baby with gestational >37 weeks and postnatal age < or= 28 days

The above is a clinical trial inclusion criterion. Annotated with entity spans:
[Person: Male] or [Person: female] [Condition: term] [Person: baby] with [Measurement: gestational] [Value: >37 weeks] and [Measurement: postnatal age] [Value: < or= 28 days]